Which microRNAs are involved in targeting CYLD in triple negative breast cancer?

MicroRNA-301b promotes cell proliferation and apoptosis resistance in triple-negative breast cancer by targeting CYLD. Knockdown of miR-182 up-regulates the expression of cylindromatosis (CYLD) deubiquitinase, which promotes the formation of death-inducing signaling complex (DISC) and subsequent caspase-8 activation in TNF-α-treated BT-549 cells.